Contraindication to regional anesthesia e.g. bleeding diathesis, coagulopathy

The above is a clinical trial exclusion criterion. Annotated with entity spans:
[Condition: Contraindication] to [Procedure: regional anesthesia] e.g. [Condition: bleeding diathesis], [Condition: coagulopathy]